一位1歲女嬰因呼吸急促至急診就醫，身體檢查發現有吐氣末端哮鳴（end-expiratory wheezing），若因感染造成，下列敘述何者最不恰當？
A. 嚴重病人常發生於1歲以下
B. 最常見的病毒為RSV（respiratory syncytial virus）
C. 傳染途徑主要為空氣傳染（air-borne）
D. 常先有上呼吸道症狀如流鼻水，然後發生哮鳴（wheezing）

正確答案：C. 傳染途徑主要為空氣傳染（air-borne）